Patients with a history of allergic reactions to loxapine or amoxapine

The above is a clinical trial exclusion criterion. Annotated with entity spans:
Patients with a history of [Condition: allergic reactions] to [Drug: loxapine] or [Drug: amoxapine]